¿Qué son las “Guías de Práctica Clínica”?:
1. Manuales elaborados para los “practicum” de los alumnos de posgrado, en los que se dan normas y se detallan algunas consideraciones necesarias para esa etapa de su formación.
2. Una colección de publicaciones en papel y digitales en la que profesionales sanitarios de gran prestigio relatan experiencias y exponen planteamientos de notable interés.
3. Informes seleccionados por las Direcciones Asistenciales de algunos hospitales de referencia, en los que los profesionales sanitarios explican casos y eventos clínicos significativos.
4. Un tipo de aplicaciones informáticas, que permiten a los profesionales sanitarios obtener respuestas en línea, a dudas que deseen formular acerca de acontecimientos sucedidos en su práctica clínica cotidiana.
5. Un conjunto de recomendaciones, diseñadas para ayudar tanto a los profesionales como a los usuarios a seleccionar las opciones diagnósticas y terapéuticas más adecuadas.

Respuesta correcta: 5. Un conjunto de recomendaciones, diseñadas para ayudar tanto a los profesionales como a los usuarios a seleccionar las opciones diagnósticas y terapéuticas más adecuadas.